下列那一類失語症之流暢（fluency）、理解（comprehension）、覆誦（repetition）能力大致正常？
A. 命名型失語症（anomic aphasia）
B. 傳導型失語症（conduction aphasia）
C. 渥尼克失語症（Wernicke's aphasia）
D. 布洛卡失語症（Broca's aphasia）

正確答案：A. 命名型失語症（anomic aphasia）